Clinical trial inclusion criterion:
Patients on regular hemodialysis 3sessions/wk.

Entity relations:
- Has_multiplier("regular hemodialysis", "3sessions/wk")